有一溺水小孩從水中救起，沒有呼吸，此時最不適當之處置為：
A. 立即進行人工呼吸
B. 按壓腹部使胃內的水流出
C. 注意體溫之維持
D. 注意頸椎之保護

正確答案：B. 按壓腹部使胃內的水流出